下列何者攜帶支配心包膜（pericardium）的感覺神經纖維？
A. 肋間神經（intercostal nerve）
B. 膈神經（phrenic nerve）
C. 迷走神經（vagus nerve）
D. 交感神經幹（sympathetic trunk）

正確答案：B. 膈神經（phrenic nerve）